Which deep learning framework has been developed for cancer molecular subtype classification?

DeepCC is a novel deep learning-based framework for cancer molecular subtype classification. In two case studies about colorectal and breast cancer classification, DeepCC classifier and DeepCC single sample predictors both achieved overall higher sensitivity, specificity, and accuracy compared with other widely used classification methods such as random forests (RF), support vector machine (SVM), gradient boosting machine (GBM), and multinomial logistic regression algorithms.